5. Currently using carbohydrate counting as the meal insulin dose strategy.

The above is a clinical trial inclusion criterion. Annotated with entity spans:
[Parsing_Error: 5.] [Temporal: Currently] using [Procedure: carbohydrate counting] as the [Procedure: meal insulin dose strategy].